Pregnancy, coagulopathy, allergy to bupivacaine, renal failure, hepatic insufficiency, and/or inappropriate candidate for usual therapy (specifically, if unable to receive the usual preoperative interscalene nerve block: preexisting nerve injury on side of surgery, refusal of nerve block, infection at site of nerve block).

The above is a clinical trial exclusion criterion. Annotated with entity spans:
[Condition: Pregnancy], [Condition: coagulopathy], [Condition: allergy] to [Drug: bupivacaine], [Condition: renal failure], [Condition: hepatic insufficiency], and/or [Condition: inappropriate candidate] for [Procedure: usual therapy] (specifically, if [Mood: unable to receive] the usual [Procedure: preoperative interscalene nerve block]: [Temporal: preexisting] [Condition: nerve injury] on [Qualifier: side of surgery], [Condition: refusal of nerve block], [Condition: infection] at [Qualifier: site of nerve block]).